關於人類乳突病毒（human papillomavirus, HPV）感染所引發之皮膚黏膜疾病，下列敘述何者錯誤？
A. HPV type 2,4 可引發尋常性疣（verruca vulgaris or common wart）
B. HPV type 16,18 與肛門生殖器疣（anogenital wart）及子宮頸癌（cervical carcinoma）有關
C. 接種對抗 HPV type 16,18 之疫苗對於預防子宮頸癌沒有幫助
D. 皮膚上皮疣樣增生不全（epidermodysplasia verruciformis）之患者缺乏對抗 HPV 感染之免疫力，故容易產生多發性疣（multiple warts）

正確答案：C. 接種對抗 HPV type 16,18 之疫苗對於預防子宮頸癌沒有幫助